Clinical trial exclusion criterion:
age > 80 years

Entity relations:
- Has_value("age", "> 80 years")